Clinical trial inclusion criterion:
9. Had never received an analgesic regimen that contained lidocaine or gabapentin

Entity relations:
- AND("analgesic regimen", "lidocaine")
- OR("lidocaine", "gabapentin")